Clinical trial exclusion criterion:
An active or any history of neurological disorder, including but not limited to seizure disorder, epilepsy, stroke, neurological disease, cognitive impairment, head trauma with prolonged loss of consciousness (>10 minutes), or migraine headaches;

Annotated entities:
- Condition: "neurological disorder"
- Temporal: "history"
- Qualifier: "active"
- Condition: "seizure disorder"
- Condition: "epilepsy"
- Condition: "stroke"
- Condition: "neurological disease"
- Condition: "cognitive impairment"
- Condition: "head trauma"
- Condition: "prolonged loss of consciousness"
- Qualifier: ">10 minutes"
- Condition: "migraine headaches"